What is the mode of action of dexamethasone?

Dexamethasone (Dex), a synthetic glucocorticoid (GC), in feed has been shown to increase gut permeabilit